Clinical trial exclusion criterion:
Morbid obesity (BMI=40kg/m2)

Entity relations:
- Has_value("BMI", "40kg/m2")
- AND("Morbid obesity", "BMI")